腕隧道症候群（carpal tunnel syndrome）嚴重者，會導致一些肌肉無力，但下列何者不受影響？
A. 拇指對掌肌（opponens pollicis）
B. 拇指屈曲短肌（flexor pollicis brevis）
C. 拇指內收肌（adductor pollicis）
D. 拇指外展短肌（abductor pollicis brevis）

正確答案：C. 拇指內收肌（adductor pollicis）